Able to provide informed consent indicating that they understand the purpose of this study and are willing to adhere to the procedures described in this protocol

The above is a clinical trial inclusion criterion. Annotated with entity spans:
[Non-query-able: Able to provide informed consent indicating that they understand the purpose of this study and are willing to adhere to the procedures described in this protocol]